Is a user of recreational or illicit drugs or has or had a substance abuse (drug or alcohol) problem within the previous 2 years

The above is a clinical trial exclusion criterion. Annotated with entity spans:
[Intoxication_considerations: Is a user of recreational or illicit drugs or has or had a substance abuse (drug or alcohol) problem within the previous 2 years]